下列何種疾病所造成的急性腎損傷，其血液檢驗結果最少發生eosinophilia？
A. microscopic polyangiitis
B. atheroembolic disease
C. NSAID-induced interstitial nephritis
D. polyarteritis nodosa

正確答案：A. microscopic polyangiitis